Clinical trial exclusion criterion:
• Patients without PN during their hospitalization

Annotated entities:
- Negation: "without"
- Procedure: "PN"
- Temporal: "during their hospitalization"
- Procedure: "hospitalization"
- Reference_point: "their hospitalization"